Clinical trial inclusion criterion:
Unresectable (locally advanced) stage IIIa or IIIb disease

Annotated entities:
- Condition: "stage IIIb disease"
- Condition: "stage IIIa disease"
- Qualifier: "Unresectable"
- Qualifier: "locally advanced"